Clinical trial exclusion criteria:
Women with confirmed or suspected pregnancy
Women under lactation and/or puerperium
Hypersensibility to ingredients of intervention
Physical impossibility for apply the drug
Known pancreatic, renal, hepatic, heart or thyroid diseased
Hypertension diagnosis
Previous treatment for glucose
Body Mass Index =39.9 kg/m2
Triglycerides =500 mg/dL
Total cholesterol =300 mg/dL
Night or rotating shift workers
Blood Pressure =140/90 mmHg

Annotated entities:
- Person: "Women"
- Condition: "pregnancy"
- Qualifier: "confirmed"
- Qualifier: "suspected"
- Person: "Women"
- Condition: "lactation"
- Condition: "puerperium"
- Condition: "Hypersensibility"
- Drug: "ingredients of intervention"
- Non-representable: "Physical impossibility for apply the drug"
- Condition: "thyroid disease"
- Condition: "heart disease"
- Condition: "hepatic disease"
- Condition: "renal disease"
- Condition: "pancreatic disease"
- Condition: "Hypertension"
- Procedure: "treatment for glucose"
- Temporal: "Previous"
- Measurement: "Body Mass Index"
- Value: "=39.9 kg/m2"
- Measurement: "Triglycerides"
- Value: "=500 mg/dL"
- Measurement: "Total cholesterol"
- Value: "=300 mg/dL"
- Person: "rotating shift workers"
- Person: "Night shift workers"
- Measurement: "Blood Pressure"
- Value: "=140/90 mmHg"